Clinical trial inclusion criterion:
Not having taken the direct oral anticoagulant on the day of the extraction

Annotated entities:
- Temporal: "on the day of the extraction"
- Reference_point: "extraction"
- Negation: "Not"
- Drug: "anticoagulant"
- Qualifier: "oral"